下列有關急性闌尾炎（acute appendicitis）的敘述，何者錯誤？
A. 腹痛通常發生於上腹部或肚臍周圍，12 小時後可能移到右下腹部
B. 急性發炎若未處置，36 小時內可能形成壞疽、穿孔
C. 若無 psoas sign 或 obturator sign 出現，即可排除此診斷
D. 白血球可能上升到 10000 至 20000/μL

正確答案：C. 若無 psoas sign 或 obturator sign 出現，即可排除此診斷